Current use of either ACE inhibitors or angiotensin II receptor blockers,

The above is a clinical trial exclusion criterion. Annotated with entity spans:
[Temporal: Current use] of either [Drug: ACE inhibitors] or [Drug: angiotensin II receptor blockers],